Explain the action of Balovaptan.

Balovaptan is a low-molecular-weight, orally active, hydrophilic non-peptide dual antagonist of both the V1a and V2a receptors that is approved for the treatment of autism spectrum disorders (ASD) in children and adults with intellectual disability.